Clinical trial inclusion criterion:
Knee symptomatic OA (Kellgren-Lawrence grade 1-4)

Annotated entities:
- Qualifier: "symptomatic"
- Condition: "OA Knee"
- Measurement: "Kellgren-Lawrence grade"
- Value: "1-4"